¿Cuál de los siguientes compuestos no puede servir como precursor para la síntesis de glucosa vía gluconeogénesis?:
1. Acetato.
2. Glicerol
3. Lactato.
4. Oxalacetato.
5. α-cetoglutarato.

Respuesta correcta: 1. Acetato.